Clinical trial exclusion criterion:
require combination immunotherapy

Annotated entities:
- Procedure: "combination immunotherapy"
- Mood: "require"